Clinical trial exclusion criterion:
Patients with clinically significant mental health issues such as psychosis requiring treatment with antipsychotic medications.

Entity relations:
- AND("treatment", "antipsychotic medications")
- Has_qualifier("mental health issues", "clinically significant")
- Subsumes("mental health issues", "psychosis")
- AND("mental health issues", "treatment")